Clinical trial exclusion criterion:
Clinical or laboratory evidence of systemic infection

Annotated entities:
- Undefined_semantics: "Clinical or laboratory evidence of systemic infection"